Clinical trial inclusion criterion:
Ulcerative colitis patients with moderate to severe activity who achieved a clinical remission by the first course of corticosteroids

Annotated entities:
- Condition: "Ulcerative colitis"
- Qualifier: "moderate to severe"
- Condition: "clinical remission"
- Temporal: "by the first course of corticosteroids"
- Reference_point: "first course of corticosteroids"
- Multiplier: "first course"
- Drug: "corticosteroids"